Patients with respiratory distress syndrome

The above is a clinical trial exclusion criterion. Annotated with entity spans:
Patients with [Condition: respiratory distress syndrome]